Clinical trial exclusion criterion:
Patients unable or not willing to return for follow-ups.

Annotated entities:
- Post-eligibility: "Patients unable or not willing to return for follow-ups"